Clinical trial inclusion criterion:
5. Patients with carpal tunnel syndrome must have had a diagnosis by combination clinical neurological examination (e.g., Phalen's and Tinel's signs), electrodiagnostic testing, and daily painful symptoms of at least 3 months' duration

Entity relations:
- Subsumes("clinical neurological examination", "Phalen's signs")
- Has_temporal("painful symptoms", "at least 3 months' duration")
- Has_multiplier("painful symptoms", "daily")
- AND("carpal tunnel syndrome", "clinical neurological examination")
- AND("carpal tunnel syndrome", "electrodiagnostic")
- AND("carpal tunnel syndrome", "painful symptoms")
- Subsumes("clinical neurological examination", "Tinel's signs")